Clinical trial exclusion criterion:
Hypersensitivity to bisoprolol or to any of the excipients.

Annotated entities:
- Condition: "Hypersensitivity"
- Drug: "bisoprolol"
- Drug: "excipients"
- Qualifier: "any"